Participant taking any glucose-containing medication concurrently

The above is a clinical trial exclusion criterion. Annotated with entity spans:
Participant taking any [Procedure: glucose-containing medication] concurrently